Known hypersensitive reaction to cinnamon.

The above is a clinical trial exclusion criterion. Annotated with entity spans:
Known [Condition: hypersensitive reaction to cinnamon].